Clinical trial exclusion criterion:
Other respiratory disorders: Subjects with active tuberculosis, lung cancer, bronchiectasis, sarcoidosis, pulmonary fibrosis, pulmonary hypertension, interstitial lung diseases or other active pulmonary diseases.

Entity relations:
- Subsumes("Other respiratory disorders", "tuberculosis")
- OR("tuberculosis", "lung cancer", "bronchiectasis", "sarcoidosis", "pulmonary fibrosis", "pulmonary hypertension", "interstitial lung diseases", "active pulmonary diseases")